What rare disease is associated with a mutation in the GPC6 gene on chromosome 13?

The proband had normal molecular analysis of the glypican 6 gene (GPC6), which was recently reported as a candidate for autosomal recessive omodysplasia